Panel reacting antibodies(PRA) >25% in most recent test or considered to be of high risk for rejection which requires an enhanced immunosuppression.

The above is a clinical trial exclusion criterion. Annotated with entity spans:
[Measurement: Panel reacting antibodies(PRA)] [Value: >25%] in [Temporal: most recent test] or [Mood: considered to be of high risk] for [Condition: rejection] which requires an [Procedure: enhanced immunosuppression].